分枝桿菌可抵抗酸性酒精脫色的耐酸性是和此菌細胞壁上的何種成分有關？
A. 阿拉伯半乳聚糖（arabinogalactan）
B. 脂質（lipid）
C. 胜	肽	聚 糖 （peptidoglycan）
D. 蛋白質（protein）

正確答案：B. 脂質（lipid）